List proteins that are contained in atherosclerotic plaques?

extracellular matrix proteins
biglycan
Lumican
Apolipoprotein A-I